Where in the cell does the proteins S100A4 and p53 interact ?

S100A4 interacts with p53 in the cell nucleus.